下列有關踝關節扭傷急性處理的原則，何者有誤？
A. 避免進行引起疼痛之運動
B. 可一天冰敷 4 次，每次約 20 分鐘
C. 此時關節活動受損，可幫病人腳踝拉筋
D. 可於患處綁彈性繃帶

正確答案：C. 此時關節活動受損，可幫病人腳踝拉筋